Clinical trial exclusion criterion:
Signs of kidney injury/failure

Annotated entities:
- Condition: "kidney injury"
- Condition: "kidney failure"
- Mood: "Signs of"